Clinical trial exclusion criterion:
With a history of mental illness and/or family history of mental illness;

Annotated entities:
- Condition: "mental illness"
- Observation: "family history"
- Condition: "mental illness"
- Temporal: "history"